Clinical trial inclusion criteria:
ASA physical status 1 or 2
Written informed consent
Cardiovascular disease
Pulmonary disease
Liver disease
CNS disease
Alcohol or drug abuse
Chronic intake of CNS active drugs
Body mass index > 35
Diabetes mellitus
Hypersensitivity or allergy to one of the study drugs

Annotated entities:
- Measurement: "ASA physical status"
- Value: "1"
- Value: "2"
- Informed_consent: "Written informed consent"
- Condition: "Cardiovascular disease"
- Condition: "Pulmonary disease"
- Condition: "Liver disease"
- Condition: "CNS disease"
- Condition: "Alcohol abuse"
- Condition: "drug abuse"
- Multiplier: "Chronic intake"
- Drug: "CNS active drugs"
- Measurement: "Body mass index"
- Value: "> 35"
- Condition: "Diabetes mellitus"
- Condition: "Hypersensitivity"
- Condition: "allergy"
- Drug: "study drugs"